Aducanumab can be used for treatment of which disease?

Aducanumab is approved for treatment of Alzheimer's disease.